Bilirubin level at/above 100 umol per liter (5.8 mg/dL)

The above is a clinical trial inclusion criterion. Annotated with entity spans:
[Measurement: Bilirubin level] [Value: at/above 100 umol per liter] (5.8 mg/dL)